若成年人因疾病或意外喪失其行為自主能力時，其手術同意書之簽立可由代理人為之，根據醫療法之規定，下列何者為最優先順位？
A. 配偶
B. 父母
C. 子女
D. 兄弟姊妹

正確答案：A. 配偶